Clinical trial inclusion criterion:
concomitant medical illness that in the opinion of the investigator is associated with a life expectancy < 1 year

Annotated entities:
- Condition: "concomitant medical illness"
- Qualifier: "is associated with a life expectancy < 1 year"